下列何者不是喉返神經（recurrent laryngeal nerve）損傷的常見原因？
A. 主動脈之血管瘤（aneurysm of the aorta）
B. 動脈導管（ductus arteriosus）閉鎖
C. 縱隔腔淋巴結腫大（enlargement of mediastinal lymph nodes）
D. 食道惡性腫瘤（esophageal carcinoma）

正確答案：B. 動脈導管（ductus arteriosus）閉鎖